Patients on Sandostatin Lar (long acting somatostatin analogue) must be on a stable dose for 30 days prior to study entry and short acting somatostatin analogues must be judged to be on a clinically stable dose by the investigator prior to study entry

The above is a clinical trial inclusion criterion. Annotated with entity spans:
Patients on [Drug: Sandostatin Lar] ([Drug: long acting somatostatin analogue]) must be on a [Qualifier: stable dose] [Temporal: for 30 days prior to study entry] and [Drug: short acting somatostatin analogues] must be judged to be on a [Qualifier: clinically stable dose] by the investigator [Temporal: prior to study entry]